With which cancers has the loss of SMARCB1 been associated?

Genotyping cancer-associated genes in chordoma identifies mutations in oncogenes and areas of chromosomal loss involving CDKN2A, PTEN, and SMARCB1. Loss of SMARCB1/INI1 expression is considered to be a hallmark for childhood chordomas . The diagnosis is all the more challenging that other poorly differentiated cancers lose SMARCB1 expression, such as epithelioid sarcomas .